Which 2 medications are included in the Qsymia pill?

Qsymia pill includes phentermine and topiramate. It is used for treatment of obesity.